Contraindications to disulfiram treatment (liver disease, kidney disease, cardiac disease, seizure disorder, hypothyroidism, diabetes mellitus, pregnancy or lactation, allergy to disulfiram or thiuran derivatives)

The above is a clinical trial exclusion criterion. Annotated with entity spans:
[Condition: Contraindications] to [Drug: disulfiram] treatment ([Condition: liver disease], [Condition: kidney disease], [Condition: cardiac disease], [Condition: seizure disorder], [Condition: hypothyroidism], [Condition: diabetes mellitus], [Condition: pregnancy] or [Condition: lactation], [Condition: allergy] to [Drug: disulfiram] or [Drug: thiuran derivatives])